Which genes are affected in ROMANO-WARD syndrome?

The genes involved in ROMANO-WARD syndrome are KCNQ1, KCNE1, KCNE2, KCNH2,  SCN5A, CAV3, SCN4B, AKAP9, SNTA1, KCNJ5 and  Ankyrin-B.